Clinical trial exclusion criterion:
Less than 18 years of age;

Entity relations:
- Has_value("age", "Less than 18 years")